一位 62 歲女性慢性咳嗽被當成氣喘治療 1 個月，直到咳血才轉到胸腔外科，氣管鏡切片診斷為氣管上段的 adenoid cystic carcinoma，接下來的處置，下列何者較理想？
A. 先化學治療再手術
B. 進行氣切造口，不須考慮手術切除
C. 經評估後直接手術切除作氣管重建
D. 作放射治療即可

正確答案：C. 經評估後直接手術切除作氣管重建